Clinical trial exclusion criterion:
History of head injury or stroke

Entity relations:
- Has_temporal("head injury", "History")
- OR("head injury", "stroke")